Clinical trial inclusion criterion:
Low or intermediate risk level surgery

Annotated entities:
- Procedure: "intermediate risk level surgery"
- Procedure: "risk level surgery Low"